Clinical trial exclusion criterion:
Contraindication for IAP measurement in supine position with head-of-bed at 0°

Annotated entities:
- Condition: "Contraindication"
- Procedure: "IAP measurement"
- Qualifier: "supine position"
- Qualifier: "head-of-bed at 0°"